某學者比較甲乙兩個國家的死亡率時，粗死亡率（crude death rate）甲國比乙國高（甲國 900 人/每 10 萬人，乙國 800 人/每 10 萬人）。甲國的年齡標準化死亡率（age-standardized death rate）則比乙國低（甲國 738 人/每 10 萬人，乙國 770 人/每 10 萬人），下列敘述何者正確？
A. 甲國平均每年每 10 萬人口死亡 738 人
B. 甲國的老年人口比乙國少
C. 標準化死亡率可以使用第三國當參考族群
D. 使用不同參考族群的標準化死亡率可以互相比較

正確答案：C. 標準化死亡率可以使用第三國當參考族群